對無母數分析的描述下列何者錯誤？
A. 對資料的極端數值較為敏感
B. 不需假設資料呈常態分布
C. 統計檢定力較有母數分析低
D. 適合處理小樣本的分析

正確答案：A. 對資料的極端數值較為敏感